Clinical trial exclusion criterion:
patients with cervical incompetence;

Annotated entities:
- Condition: "cervical incompetence"